5. AP ≥ 1.67 × ULN

The above is a clinical trial inclusion criterion. Annotated with entity spans:
[Parsing_Error: 5.] [Measurement: AP] [Value: ≥ 1.67 × ULN]